Clinical trial exclusion criterion:
Poorly controlled pulmonary disease (severe asthma or COPD) -Contraindication to regional anesthesia (recent anticoagulant use)

Entity relations:
- Has_qualifier("asthma", "severe")
- Has_qualifier("pulmonary disease", "Poorly controlled")
- Subsumes("pulmonary disease", "asthma")
- AND("Contraindication", "regional anesthesia")
- Has_temporal("anticoagulant", "recent")
- Subsumes("Contraindication", "anticoagulant")
- OR("asthma", "COPD")